Clinical trial inclusion criterion:
Men and women between ages >=18 and 65.

Entity relations:
- Has_value("ages", "between 18 and 65")
- OR("Men", "women")